有關舌骨上肌（suprahyoid muscles）之敘述，下列何者正確？
A. 二腹肌的後腹（posterior belly of digastric muscle）由顏面神經（facial nerve）支配
B. 二腹肌的前腹（anterior belly of digastric muscle）由舌下神經（hypoglossal nerve）支配
C. 下頜舌骨肌（mylohyoid muscle）由舌下神經（hypoglossal nerve）支配
D. 莖突舌骨肌（stylohyoid muscle）由下頜神經（mandibular nerve）支配

正確答案：A. 二腹肌的後腹（posterior belly of digastric muscle）由顏面神經（facial nerve）支配